Inability to attend follow-up appointments

The above is a clinical trial exclusion criterion. Annotated with entity spans:
[Observation: Inability to attend follow-up appointments]